關於 T 輔助細胞在 B 細胞活化過程中所提供協助的敘述，下列那一項錯誤？
A. 兩種細胞必須辨識同一種抗原（linked recognition），才能有效刺激抗體生成
B. T 輔助細胞分泌細胞激素（cytokines）協助 B 細胞的複製與活化
C. T 輔助細胞表面表現 CD40L 分子，可協助 B 細胞第 2 訊號的傳遞
D. T 輔助細胞表面表現 B7，是主要的協同刺激因子（co-stimulatory molecule）

正確答案：D. T 輔助細胞表面表現 B7，是主要的協同刺激因子（co-stimulatory molecule）